Clinical trial inclusion criterion:
Body mass index to be between 18 to 30 kg/m2 (inclusive) as calculated by weight(Kg)/height(m2).

Entity relations:
- Has_value("Body mass index", "between 18 to 30 kg/m2")